El isotipo de inmunoglobulina más abundante producido por células plasmáticas del tejido linfoide asociado a mucosas es:
1. IgM.
2. IgD.
3. IgG.
4. IgA.
5. IgE.

Respuesta correcta: 4. IgA.